Clinical trial exclusion criterion:
Atypical hemolytic uremic syndrome (aHUS) / thrombotic thrombocytopenic purpura syndrome.

Entity relations:
- OR("Atypical hemolytic uremic syndrome (aHUS)", "thrombotic thrombocytopenic purpura syndrome")